Ejection fraction <35%

The above is a clinical trial exclusion criterion. Annotated with entity spans:
[Measurement: Ejection fraction] [Value: <35%]